Clinical trial inclusion criterion:
Males and females aged between 18 to 75 years.

Annotated entities:
- Person: "Males"
- Person: "females"
- Person: "aged"
- Value: "between 18 to 75 years"